Clinical trial exclusion criterion:
Pregnant females as determined by positive serum hCG test at screening or prior to dosing.

Annotated entities:
- Condition: "Pregnant"
- Person: "females"
- Measurement: "serum hCG test"
- Value: "positive"
- Temporal: "at screening"
- Temporal: "prior to dosing"
- Reference_point: "screening"
- Reference_point: "dosing"